有關肩難產的發生，多與母體或胎兒的客觀條件相關。下列何者為與母親相關的肩難產危險因子（maternal risk factor）？
A. nulliparity
B. obesity
C. advanced maternal age
D. chronic hypertension

正確答案：B. obesity